關於雙極性疾患（bipolar disorder）與重度憂鬱症（major depressive disorder）的敘述，下列何者正確？
A. 重度憂鬱症的終生盛行率（lifetime prevalence）較低
B. 雙極性疾患的定義為必須包括重鬱期（major depressive episode）及躁期（manic episode）皆經歷
C. 重度憂鬱症的家族遺傳關聯性低於雙極性疾患，且女性患者較多
D. 兩種疾患的個案在憂鬱期接受的藥物治療皆以抗憂鬱劑為首選

正確答案：C. 重度憂鬱症的家族遺傳關聯性低於雙極性疾患，且女性患者較多